Clinical trial exclusion criteria:
Refusal
Contraindication to neuraxial (coagulopathy, anticoagulant use, local infection, sepsis etc) .Rupture of membranes.
Drop-out: Patients may choose to drop-out of the study at any time. The physicians involved in this study may choose to end a patient's involvement in the study at their discretion.

Annotated entities:
- Non-query-able: "Refusal"
- Condition: "Contraindication"
- Procedure: "neuraxial"
- Condition: "coagulopathy"
- Drug: "anticoagulant"
- Condition: "local infection"
- Condition: "sepsis"
- Condition: "Rupture of membranes"
- Non-query-able: "Drop-out: Patients may choose to drop-out of the study at any time. The physicians involved in this study may choose to end a patient's involvement in the study at their discretion."